糖皮質激素（glucocorticoids）主要是以下列何種方式進入細胞，調節基因轉錄作用？
A. 與細胞膜上之受體結合再進入細胞，直接結合在DNA序列上
B. 與細胞膜上之受體結合後，經由訊息傳遞路徑
C. 直接通過細胞膜，進入細胞後直接結合在DNA序列上
D. 直接通過細胞膜，進入細胞後和受體結合，再結合在DNA序列上

正確答案：D. 直接通過細胞膜，進入細胞後和受體結合，再結合在DNA序列上